Clinical trial exclusion criterion:
Clinical history of lactose-intolerance or allergies to cow-milk

Entity relations:
- OR("lactose-intolerance", "allergies to cow-milk")